Clinical trial exclusion criterion:
Patients in recent receipt of live vaccinations within 4 weeks prior to enrolment

Entity relations:
- Has_temporal("live vaccinations", "within 4 weeks prior to enrolment")